age > 17 and < 60 years;

The above is a clinical trial inclusion criterion. Annotated with entity spans:
[Person: age] [Value: > 17 and < 60 years];